Clinical trial exclusion criterion:
Estimated intelligence quotient score lower than 70

Annotated entities:
- Measurement: "Estimated intelligence quotient score"
- Value: "lower than 70"